Clinical trial inclusion criterion:
1. age 18-65 years, inclusive

Entity relations:
- Has_value("age", "18-65 years, inclusive")